Relacionando componentes de leche humana y sistema inmunitario, es FALSO que:
1. La lactoferrina protege frente a infecciones por su capacidad de ligar hierro.
2. Los péptidos de caseína tienen actividad antimicrobiana e inmunoestimulante.
3. Las citoquinas modulan el sistema inmunitario en la infancia.
4. Los oligosacáridos complejos pueden ser falsos receptores para bacterias en el intestino.
5. La lisozima degrada las paredes celulares de microorganismos gramnegativos.

Respuesta correcta: 5. La lisozima degrada las paredes celulares de microorganismos gramnegativos.